Clinical trial exclusion criterion:
4. Subjects with history or evidence upon physical examination of CNS disease, including primary brain tumor, seizures not controlled with standard medical therapy, any brain metastases, or, within six months prior to Day 1 of this study, history of cerebrovascular accident (CVA, stroke), transient ischemic attack (TIA) or subarachnoid hemorrhage.

Annotated entities:
- Parsing_Error: "4."
- Condition: "CNS disease"
- Condition: "primary brain tumor"
- Condition: "seizures"
- Qualifier: "controlled"
- Negation: "not"
- Drug: "standard medical therapy"
- Condition: "brain metastases"
- Temporal: "within six months prior to Day 1 of this study"
- Reference_point: "Day 1 of this study"
- Condition: "cerebrovascular accident"
- Condition: "CVA"
- Condition: "stroke"
- Condition: "transient ischemic attack (TIA)"
- Condition: "subarachnoid hemorrhage"